Clinical trial exclusion criterion:
pregnant or breastfeeding patients

Entity relations:
- OR("pregnant", "breastfeeding")